Clinical trial inclusion criterion:
HbA1c = 6.5 and = 10.0 %

Annotated entities:
- Measurement: "HbA1c"
- Value: "= 6.5 and = 10.0 %"